一位右側膝下截肢的病人在給予義肢裝配及訓練後，現在病人可以自行走路，則此病人應屬世界衛生組織定義之下列何種狀況？
A. impairment
B. disability
C. handicap
D. normal

正確答案：A. impairment